Acute myocardial infarction or acute coronary syndrome, transient ischemic attack or stroke within the last 3 months.

The above is a clinical trial exclusion criterion. Annotated with entity spans:
[Condition: Acute myocardial infarction] or [Condition: acute coronary syndrome], [Condition: transient ischemic attack] or [Condition: stroke] [Temporal: within the last 3 months].